adults capable of providing consent

The above is a clinical trial inclusion criterion. Annotated with entity spans:
[Person: adults] [Informed_consent: capable of providing consent]